Patient has an active pathological bleeding, such as active gastrointestinal (GI) bleeding

The above is a clinical trial inclusion criterion. Annotated with entity spans:
Patient has an [Qualifier: active] [Condition: pathological bleeding], such as [Qualifier: active] [Condition: gastrointestinal (GI) bleeding]